對於 Clostridium difficile colitis 敘述，下列何者錯誤？
A. 百分之 45 到 55 的 Clostridium difficile colitis 發生在外科的病患，尤其是接受一般外科和血管外科手術的機會最高
B. Clostridium difficile 過度增生會造成不同程度的疾病，從沒有症狀的帶原者到 self-limited colitis，偽膜性大腸炎（pseudomembranous colitis），猛爆性大腸炎（fulminant colitis）到毒性巨結腸症
C. 主要治療方法是 vancomycin 靜脈注射
D. 電腦斷層上的表現主要是結腸壁變厚和水腫以及有腹水產生

正確答案：C. 主要治療方法是 vancomycin 靜脈注射